Clinical trial inclusion criterion:
Bloodstream infection with Enterobacter spp., Serratia marcescens, Providencia spp., Morganella morganii or Citrobacter freundii (i.e. likely AmpC-producer), and susceptibility to 3rd generation cephalosporins (i.e. ceftriaxone, cefotaxime or ceftazidime), meropenem and piperacillin-tazobactam from at least one blood culture draw. This will be determined in accordance with laboratory methods and susceptibility breakpoints defined by protocols used in the recruiting site laboratories..

Entity relations:
- Has_qualifier("Bloodstream infection", "Serratia marcescens")
- Subsumes("3rd generation cephalosporins (", "ceftriaxone")
- Has_multiplier("blood culture", "at least one")
- AND("blood culture", "Bloodstream infection")
- AND("Bloodstream infection", "3rd generation cephalosporins (")
- AND("Serratia marcescens", "Providencia spp.")
- AND("Serratia marcescens", "Morganella morganii")
- AND("Serratia marcescens", "Citrobacter freundii")
- OR("Enterobacter spp.", "Serratia marcescens", "Providencia spp.", "Morganella morganii", "Citrobacter freundii")
- OR("ceftriaxone", "cefotaxime", "ceftazidime")